Clinical trial exclusion criterion:
Patients who may receive therapeutically effective doses via an external beam approach to the lesion of interest as specified by MSKCC Radiation Oncology Department dose constraint criteria.

Annotated entities:
- Measurement: "MSKCC Radiation Oncology Department dose constraint criteria"
- Condition: "may receive therapeutically effective doses via an external beam approach to the lesion of interest"
- Qualifier: "therapeutically effective"
- Procedure: "doses"
- Procedure: "external beam"
- Context_Error: "Patients who may receive therapeutically effective doses via an external beam approach to the lesion of interest as specified by MSKCC Radiation Oncology Department dose constraint criteria"